Clinical trial exclusion criterion:
History of allergic disease or reactions likely to be exacerbated by any component of the vaccines.

Entity relations:
- AND("History", "allergic disease")
- Has_qualifier("allergic disease", "exacerbated")
- OR("allergic disease", "reactions allergic")